接受高劑量腎上腺皮質素治療的兒童，在預防接種時需避免下列何種疫苗？
A. 麻疹、腮腺炎及德國麻疹（MMR）疫苗
B. B 型肝炎疫苗
C. 白喉、百日咳及破傷風（DPT）疫苗
D. 小兒麻痺不活化病毒疫苗（沙克疫苗）

正確答案：A. 麻疹、腮腺炎及德國麻疹（MMR）疫苗